How does condensin affect the function of topoisomeraseII?

Condensin aids sister chromatid decatenation by topoisomerase II and minimizes topoisomerase II-mediated entanglements of DNA in vivo